Optical coherence tomography central subfield thickness of at least 250 microns

The above is a clinical trial inclusion criterion. Annotated with entity spans:
[Measurement: Optical coherence tomography central subfield thickness] of [Value: at least 250 microns]